Clinical trial inclusion criterion:
Age 2-17 years

Entity relations:
- Has_value("Age", "2-17 years")